Diagnosis of ankle fracture or ligament rupture

The above is a clinical trial exclusion criterion. Annotated with entity spans:
Diagnosis of [Condition: ankle fracture] or [Condition: ligament rupture]